Clinical trial exclusion criterion:
Known hypersensitivity to PPI

Entity relations:
- AND("hypersensitivity", "PPI")